Clinical trial inclusion criterion:
Aged between 18 and 75

Annotated entities:
- Person: "Aged"
- Value: "between 18 and 75"